Clinical trial exclusion criterion:
Extensive local necrosis or blebs

Annotated entities:
- Condition: "Extensive local necrosis"
- Condition: "Extensive local blebs"